Anticoagulant treatment after the operation (e.g. warfarin, direct thrombin inhibitors (dabigatran), FXa inhibitors (rivaroxaban, apixaban, heparin, low-molecular weight heparin, fondaparinux)

The above is a clinical trial exclusion criterion. Annotated with entity spans:
[Procedure: Anticoagulant treatment] [Temporal: after the operation] (e.g. [Drug: warfarin], [Drug: direct thrombin inhibitors] ([Drug: dabigatran]), [Drug: FXa inhibitors] ([Drug: rivaroxaban], [Drug: apixaban], [Drug: heparin], [Drug: low-molecular weight heparin], [Drug: fondaparinux])